Clinical trial inclusion criterion:
Patient or parent/guardian capable of providing informed consent

Annotated entities:
- Post-eligibility: "Patient or parent/guardian capable of providing informed consent"